Clinical trial inclusion criterion:
Men or women aged 18 years or older

Annotated entities:
- Person: "Men"
- Person: "women"
- Person: "aged"
- Value: "18 years or older"